3 週大之男嬰主訴為黃疸。理學檢查發現其肝臟腫大，但脾臟則觸摸不到。實驗室檢查其直接型膽紅素為 8.6 mg/dL。下列何項影像檢查應列為最優先？
A. 腹部 X 光攝影檢查
B. 核磁共振攝影
C. 腹部電腦斷層檢查
D. 腹部超音波檢查

正確答案：D. 腹部超音波檢查